下列何項關於胸骨劍突（xiphoid process）的敘述錯誤？
A. 其外型因人而異，可尖、可鈍，也可能分枝
B. 在體表的投射點表示心臟下緣
C. 在體表的投射點表示肝臟的上界
D. 相對於第十二胸椎的高度

正確答案：D. 相對於第十二胸椎的高度